Clinical trial exclusion criterion:
Patients starting Adalimumab less than five half-lives after the interruption of a previous anti-TNF therapy.

Entity relations:
- Has_temporal("anti-TNF therapy", "previous")
- multi("the interruption of a previous anti-TNF therapy", "anti-TNF therapy")
- Has_index("less than five half-lives after the interruption of a previous anti-TNF therapy", "the interruption of a previous anti-TNF therapy")
- Has_temporal("Adalimumab", "less than five half-lives after the interruption of a previous anti-TNF therapy")